Clinical trial inclusion criterion:
Sedation and mechanical ventilation planned > 2 days

Entity relations:
- Has_mood("> 2 days", "planned")
- Has_temporal("mechanical ventilation", "> 2 days")
- Has_temporal("Sedation", "> 2 days")